Cuál de las afirmaciones siguientes describe la degradación mediada por la ubiquitina de las proteínas en el citosol?:
1. Una molécula de ubiquitina se une a la proteína que va a degradarse.
2. El proceso está catalizado por una única enzima.
3. El proceso depende de ATP.
4. La ubiquitina se une covalentemente al extremo C-terminal de la proteína que va a degradarse.

Respuesta correcta: 3. El proceso depende de ATP.